Clinical trial exclusion criterion:
9. Patients with clinically significant medical conditions as determined by the investigator including renal, hepatic, hematologic, neurologic or immune disease. Examples include but are not limited to:

Entity relations:
- Has_qualifier("medical conditions", "clinically significant")
- AND("clinically significant", "as determined by the investigator")
- Subsumes("clinically significant", "renal disease")
- OR("renal disease", "hematologic disease", "hepatic disease", "neurologic disease", "immune disease")